Clinical trial inclusion criterion:
Participants having H. pylori related chronic gastritis with/without peptic ulcers who are aged greater than 20 years old and are willing to received eradication therapy.

Annotated entities:
- Qualifier: "H. pylori related"
- Condition: "chronic gastritis"
- Condition: "peptic ulcers"
- Person: "aged"
- Value: "greater than 20 years old"
- Mood: "willing to received"
- Procedure: "eradication therapy"